植皮依據取皮的厚度有分為全層皮膚移植（full-thickness skin graft）及部分層皮膚移植（split-thickness skin graft），下列何者屬於全層皮膚移植的特性？
A. 較少的初級收縮（primary contraction）
B. 較容易存活（graft survival）
C. 較多的後期收縮（secondary contraction）
D. 較好的美觀結果

正確答案：D. 較好的美觀結果